Clinical trial exclusion criterion:
Patients with intestinal pathology or severe diarrhea that may decrease absorption according to medical criteria.

Entity relations:
- Has_context("intestinal pathology", "may decrease absorption")
- OR("intestinal pathology", "severe diarrhea")